Clinical trial exclusion criterion:
Subjects with known cardiac abnormalities (atrial septal defects or ventricular septal defects, severe tricuspid valve disease, severe pulmonary hypertension, Ejection fraction < 15%)

Entity relations:
- Has_qualifier("tricuspid valve disease", "severe")
- Has_qualifier("pulmonary hypertension", "severe")
- Has_value("Ejection fraction", "< 15%")
- Subsumes("cardiac abnormalities", "atrial septal defects")
- OR("atrial septal defects", "ventricular septal defects", "tricuspid valve disease", "pulmonary hypertension", "Ejection fraction")